a high risk profile of the patient, defined as a CHA2DS2-VASc score = 3 and a HAS-BLED score = 2

The above is a clinical trial inclusion criterion. Annotated with entity spans:
a [Condition: high risk profile] of the patient, defined as a [Measurement: CHA2DS2-VASc score] [Value: = 3] and a [Measurement: HAS-BLED score] [Value: = 2]